關於流行性感冒病毒（Influenza virus）某病毒株 A/Bangkok/1/79（H3N2）之命名，下列敘述何者錯誤？
A. A 代表此為 A 型流行性感冒病毒
B. Bangkok 代表其最早分離的地點
C. 1/79 代表此病毒株之序號
D. H3N2 代表其抗原性，HA 抗原為第三型，NA 抗原為第二型

正確答案：C. 1/79 代表此病毒株之序號